Good health condition, without clinically significant medical history (by participant or guardian, in case of minor)

The above is a clinical trial inclusion criterion. Annotated with entity spans:
[Condition: Good health condition], [Negation: without] [Qualifier: clinically significant] [Temporal: medical history] (by participant or guardian, in case of minor)